Clinical trial inclusion criterion:
Planned primary percutaneous coronary intervention

Entity relations:
- AND("Planned", "primary percutaneous coronary intervention")